Clinical trial inclusion criterion:
Patient age >= 18 years

Annotated entities:
- Person: "Patient age"
- Value: ">= 18 years"